Clinical trial exclusion criterion:
alanine aminotransferase (ALT), aspartase aminotransferase (AST), or alkaline phosphatase = 10 times upper limit of normal(ULN)

Annotated entities:
- Measurement: "alanine aminotransferase"
- Measurement: "ALT"
- Measurement: "aspartase aminotransferase"
- Measurement: "AST"
- Measurement: "alkaline phosphatase"
- Value: "= 10 times upper limit of normal"